一位懷孕30週婦女有尿路結石過去病史，因左側腰痛至急診求診，腎臟超音波呈現左側腎臟水腫，醫師診斷為疑似左側輸尿管結石，下列何者不是適當的處置？
A. 體外震波碎石術
B. 半身麻醉下施行輸尿管鏡碎石術
C. 局部麻醉下施行經皮腎臟造瘻術
D. 內視鏡置放輸尿管導管

正確答案：A. 體外震波碎石術